El término “Pseudociesis” hace referencia a:
1. La sensación de dolor en un miembro que ha sido amputado.
2. La visión imaginaría de figuras religiosas o demoniacas.
3. La dificultad para pronunciar determinadas palabras.
4. Una sensación casi constante de hormigueo por todo el cuerpo.
5. La falsa creencia de estar embarazada, asociada a signos como náuseas y aumento del abdomen.

Respuesta correcta: 5. La falsa creencia de estar embarazada, asociada a signos como náuseas y aumento del abdomen.